下列那一個病例較符合所列之動脈血氣體分析和血清電解質的檢查結果［pH：7.32，PaO2：110 mmHg， mmHg，HCO3-：18；Na+ 138，K+ 3.0，Cl- 109（電解質的單位是mmol/L）］？
A. 19歲女學生為第一型糖尿病，因期末考熬夜兩天，忘記注射胰島素
B. 39歲女性經理服用作用於遠端腎小管之利尿劑減重
C. 59歲女性有第五期慢性腎臟病
D. 69歲女性腹瀉三天

正確答案：D. 69歲女性腹瀉三天